Absence of documentation of negative tuberculin skin test, negative QuantiFERON-TB Gold test, or treatment for latent tuberculosis prior to starting treatment with the anti-TNF agent

The above is a clinical trial exclusion criterion. Annotated with entity spans:
[Negation: Absence of] documentation of [Value: negative] [Procedure: tuberculin skin test], [Value: negative] [Measurement: QuantiFERON-TB Gold test], or [Procedure: treatment] for [Qualifier: latent] [Condition: tuberculosis] [Temporal: prior to starting treatment with the anti-TNF agent]